apnea hypopnea index > 5 events per hour

The above is a clinical trial exclusion criterion. Annotated with entity spans:
[Measurement: apnea hypopnea index] [Value: > 5 events per hour]